下列有關中樞神經興奮劑藥理作用之描述，何者錯誤？
A. Amphetamine 與 Cocaine 作用方式最大的差異在於其對多巴胺再回收系統作用之差異
B. Nicotine 屬於一種中樞神經興奮劑
C. Cocaine 具有抑制單胺氧化酶（monoamine oxidase）代謝多巴胺的作用
D. Caffeine 屬於一種中樞神經興奮劑

正確答案：C. Cocaine 具有抑制單胺氧化酶（monoamine oxidase）代謝多巴胺的作用